一位 20 歲男性，因車禍被送至急診室，右側髖部無法活動，理學檢查除右髖部外其餘無異常發現， X 光片顯示右側股骨頸完全移位性骨折，且無股骨頭變形或髖臼異常之現象。則下列何者是較佳的處置？
A. 髖部人形石膏固定（hip spica）
B. 手術復位及鋼釘內固定術
C. 人工半髖關節置換手術
D. 人工全髖關節置換手術

正確答案：B. 手術復位及鋼釘內固定術